Clinical trial exclusion criterion:
Triglycerides > 500 mg/dl with or without use of fibrate;

Annotated entities:
- Measurement: "Triglycerides"
- Value: "> 500 mg/dl"
- Drug: "fibrate"